Clinical trial exclusion criterion:
Clinical conditions representing a contraindication to intramuscular vaccination and blood draws.

Annotated entities:
- Condition: "contraindication"
- Procedure: "intramuscular vaccination"
- Procedure: "blood draws"